血球凝集（hemagglutination）試	，不適用於下列何種病毒的檢測？
A. 呼吸道細胞融合病毒（Respiratory syncytial virus）
B. 腮腺炎病毒（Mumps virus）
C. 副流感病毒（Parainfluenza virus）
D. 麻疹病毒（Measles virus）

正確答案：A. 呼吸道細胞融合病毒（Respiratory syncytial virus）